Clinical trial inclusion criterion:
Platelets > 50,000

Entity relations:
- Has_value("Platelets", "> 50,000")